Anterior uveitis or iritis (past or present)

The above is a clinical trial exclusion criterion. Annotated with entity spans:
[Condition: Anterior uveitis] or [Condition: iritis] ([Temporal: past] or [Temporal: present])